催產素（Oxytocin）的敘述，何者正確？
A. 由腦下垂體後葉所合成
B. 半衰期約 2 小時
C. 產後促進子宮收縮
D. 可促進乳蛋白素（Lactalbumin）的合成

正確答案：C. 產後促進子宮收縮